陳先生 40 歲公司會計，每天抽菸約一包，最近三天感到全身不適，流鼻水及咳嗽，下班後找附近熟悉的家庭醫師看病，醫師檢查後給予藥物症狀治療，同時建議接受門診戒菸。上述的情況並未涉及基層醫療特色的那一項？
A. 可近性（accessibility）
B. 周全性（comprehensiveness）
C. 持續性（continuity）
D. 協調性（coordination）

正確答案：D. 協調性（coordination）